一位 25 歲女性因最近 3 個月無月經來診，病人並無使用任何藥物，身體檢查發現有壓擠溢乳現象外並無其他異常，腦垂腺核磁共振檢查發現一個 0.8 公分腫瘤，下列何者為最好的處置？
A. transsphenoidal resection of tumor
B. Radiotherapy with γ knife
C. Cabergoline therapy
D. Repeat MRI 4 months later

正確答案：C. Cabergoline therapy